(8)Regular usage of folic acid supplements or compounds containing folic acid in the past 3 months;

The above is a clinical trial exclusion criterion. Annotated with entity spans:
(8)[Multiplier: Regular usage] of [Drug: folic acid supplements] or [Drug: compounds containing folic acid] [Temporal: in the past 3 months];